First Diagnosed Head and neck cancer and plan for treatment with cisplatin

The above is a clinical trial inclusion criterion. Annotated with entity spans:
First Diagnosed [Condition: Head and neck cancer] and [Mood: plan] for treatment with [Drug: cisplatin]